Can have had prior Cesarean delivery

The above is a clinical trial inclusion criterion. Annotated with entity spans:
[Non-representable: Can have had prior Cesarean delivery]